Clinical trial inclusion criteria:
Cohort 1: Recurrent or refractory medulloblastoma in which current standard treatment approaches have failed; biopsy is not required for recurrent disease.
Cohort 2: Newly-diagnosed high-grade glioma (World Health Organization [WHO] grade 3 or 4)
Life expectancy ≥ 3 months

Annotated entities:
- Condition: "refractory medulloblastoma"
- Condition: "Recurrent medulloblastoma"
- Procedure: "standard treatment"
- Qualifier: "failed"
- Mood: "not required"
- Condition: "high-grade glioma"
- Measurement: "World Health Organization [WHO] grade"
- Value: "3 or 4"
- Measurement: "Life expectancy"
- Value: "≥ 3 months"